What is the mode of inheritance of  long QT  Jervell and Lange-Nielsen syndrome?

Jervell and Lange-Nielsen long QT syndrome (JLNS) is characterized by autosomal recessive mode of inheritance